傳染代隔（generation time）是指宿主得到感染至產生最大感染力之時間。如果傳染代隔越短，則：
A. 流行曲線較趨緩
B. 流行發生來得較慢
C. 流行曲線不受影響
D. 流行發生來得較快

正確答案：D. 流行發生來得較快